Clinical trial exclusion criterion:
Age less than 18 yrs

Annotated entities:
- Person: "Age"
- Value: "less than 18 yrs"